presence of benign cause for the hysterectomy e.g. fibroid uterus, perimenopausal beeding not responding to medical treatment or complex endometrial hyperplasia without atypia.

The above is a clinical trial inclusion criterion. Annotated with entity spans:
presence of [Condition: benign cause] for the [Procedure: hysterectomy] e.g. [Condition: fibroid uterus], [Condition: perimenopausal beeding] [Negation: not] [Qualifier: responding to medical treatment] or [Condition: complex endometrial hyperplasia] [Negation: without] [Condition: atypia].